Any disease or condition that interferes with completion of initial or follow-up assessments

The above is a clinical trial exclusion criterion. Annotated with entity spans:
Any [Condition: disease] or [Condition: condition] that [Qualifier: interferes with completion of initial or follow-up assessments]